5 歲無糖尿病病史的男孩，過去一年來反覆發生抽搐及意識不清而送來急診，每次測得血糖值皆低於 mg/dL。問診發現父親之朋友在每次男孩發病前均曾給予口服降血糖藥。其最適合的診斷為何？
A. 身體虐待（physical abuse）
B. 性虐待（sexual abuse）
C. 代理孟喬森症候群（Munchausen syndrome by proxy）
D. 精神虐待（psychologic abuse）

正確答案：C. 代理孟喬森症候群（Munchausen syndrome by proxy）